Clinical trial exclusion criterion:
Differential blood count < lower limit of normal (LLN) at Screening

Entity relations:
- Has_value("Differential blood count", "< lower limit of normal (LLN)")
- Has_temporal("Differential blood count", "at Screening")